Clinical trial exclusion criterion:
Ischemic stroke (determined using the Questionnaire for Verifying Stroke-Free Status (QVSFS)

Annotated entities:
- Condition: "Ischemic stroke"
- Qualifier: "Questionnaire for Verifying Stroke-Free Status (QVSFS)"